Clinical trial exclusion criterion:
Known or suspected history of malignant hyperthermia

Annotated entities:
- Condition: "malignant hyperthermia"
- Mood: "Known"
- Mood: "suspected"
- Temporal: "history"